Clinical trial inclusion criteria:
25-50 years of age
PTSD related to physical or sexual assault
Medically healthy
English speaking

Annotated entities:
- Person: "age"
- Value: "25-50 years"
- Observation: "physical assault"
- Observation: "sexual assault"
- Condition: "PTSD"
- Observation: "Medically healthy"
- Observation: "English speaking"